病童經過處置後燒退兩天，咳嗽減輕，但突然又開始發燒到 39.1℃，咳嗽加重，有痰聲。此時診斷為下列何者？
A. 過敏性氣喘發作
B. 治療藥物的副作用
C. 再次罹患上呼吸道感染
D. 併發細菌性支氣管肺炎

正確答案：D. 併發細菌性支氣管肺炎